What is regioneR?

RegioneR is an R/Bioconductor package for the association analysis of genomic regions based on permutation tests. It implements a permutation test framework specifically designed to work with genomic regions. In addition to the predefined randomization and evaluation strategies, regioneR is fully customizable allowing the use of custom strategies to adapt it to specific questions. Finally, it also implements a novel function to evaluate the local specificity of the detected association.